下列那一項是 DNA 和 RNA 共同的特性？
A. 皆為雙股 α 螺旋鏈
B. 合成過程都具有相同校正機制避免錯誤
C. 皆含有磷酸根、醣及鹼基
D. 在五碳糖的第二個位置都是-OH 基

正確答案：C. 皆含有磷酸根、醣及鹼基